Clinical trial inclusion criterion:
No other surgical contraindications.

Annotated entities:
- Negation: "No"
- Observation: "other surgical contraindications"